reports commercial sex work

The above is a clinical trial inclusion criterion. Annotated with entity spans:
reports [Observation: commercial sex work]